What is the genetic basis of Ohdo syndrome?

MED12